Which is the protein (antigen) targeted by anti-Vel antibodies in the Vel blood group?

SMIM1